Clinical trial exclusion criteria:
Received any vaccine within a month prior to study vaccine
Positive serum antibody against Hep B surface antigen and/or core Hep B core antigen
HIV positive
For HCV-negative, healthy volunteers: History of HCV infection or positive HCV antibody test
Participation in another clinical study of an investigational product currently or within the past 90 days, or expected participation during this study
In the opinion of the investigator, the volunteer is unlikely to comply with the study protocol
Any clinically significant abnormality or medical history or physical examination including history of immunodeficiency or autoimmune disease (in addition to HCV infection, for HCV group)
Currently taking systemic steroids or other immunomodulatory medications including anticancer medications and antiviral medications
Any clinically significant acute or chronic medical condition requiring care by a primary care provider (e.g., diabetes, coronary artery disease, rheumatologic illness, malignancy, substance abuse) that, in the opinion of the investigator, would preclude participation
Unable to continue participation for 156 weeks
History of previous Hepatitis B vaccination(s)
Male or female < 18 and > 62 years of age
Is pregnant or lactating
History of Hepatitis B infection
Clinical, laboratory, or biopsy evidence of cirrhosis

Annotated entities:
- Procedure: "vaccine"
- Temporal: "within a month prior to study vaccine"
- Reference_point: "study vaccine"
- Measurement: "serum antibody"
- Qualifier: "Hep B surface antige"
- Qualifier: "core Hep B core antigen"
- Value: "Positive"
- Measurement: "HIV"
- Value: "positive"
- Measurement: "HCV"
- Value: "negative"
- Temporal: "History of HCV infection"
- Competing_trial: "Participation in another clinical study of an investigational product currently or within the past 90 days, or expected participation during this study"
- Post-eligibility: "In the opinion of the investigator, the volunteer is unlikely to comply with the study protocol"
- Condition: "immunodeficiency"
- Condition: "autoimmune disease"
- Negation: "in addition to"
- Condition: "HCV infection"
- Drug: "systemic steroids"
- Procedure: "immunomodulatory medications"
- Procedure: "anticancer medications"
- Procedure: "antiviral medications"
- Condition: "diabetes"
- Condition: "coronary artery disease"
- Condition: "rheumatologic illness"
- Condition: "malignancy"
- Condition: "substance abuse"
- Post-eligibility: "Unable to continue participation for 156 weeks"
- Procedure: "Hepatitis B vaccination"
- Person: "Male"
- Person: "female"
- Value: "< 18 and > 62 years"
- Person: "age"
- Pregnancy_considerations: "Is pregnant or lactating"
- Condition: "Hepatitis B infection"
- Condition: "cirrhosis"